Clinical trial exclusion criterion:
Sinoatrial block.

Annotated entities:
- Condition: "Sinoatrial block"